Clinical trial exclusion criterion:
Over the age of 80

Entity relations:
- Has_value("age", "Over 80")